Clinical trial inclusion criterion:
Deformities or curvatures (including kyphosis, lordosis, or scoliosis)

Entity relations:
- Subsumes("Deformities", "kyphosis")
- OR("kyphosis", "lordosis", "scoliosis")
- OR("Deformities", "curvatures")